Clinical trial exclusion criterion:
DSM-IV-TR substance-related disorders (except nicotine)

Entity relations:
- Has_qualifier("substance-related disorders", "DSM-IV-TR")
- Has_negation("nicotine", "except")
- AND("substance-related disorders", "nicotine")